在 11-羥酶缺乏（11-hydroxylase deficiency）所致先天性腎上腺增生（congenital adrenal hyperplasia）的臨床表徵中，下列何者最常見？
A. 高血壓（hypertension）
B. 低血糖（hypoglycemia）
C. 低血鈉（hyponatremia）
D. 高血鉀（hyperkalemia）

正確答案：A. 高血壓（hypertension）